胸腺依賴性（thymus-dependent）抗原活化B細胞需要輔助型T細胞的參與，而且這兩種細胞所辨識的抗原 是存在一種相關性辨識（linked recognition）的關係，有關相關性辨識的敘述，何者錯誤？
A. 如果一個B細胞的抗原接受器是辨識一種病毒的表面蛋白，而輔助型T細胞的抗原接受器是辨識此病毒內部的核心蛋白，這個輔助型T細胞是無法協助前述B細胞的活化
B. 相關性辨識可以確保自我耐受性（self-tolerance）的產生，因為對自體有反應的（self-reactive）T細胞必
C. 我們可以利用相關性辨識的概念來設計疫苗幫助嬰兒產生有效的抗體，去對付具有莢膜構造的病菌，比如
D. 很多人對盤尼⻄林（penicillin）過敏的原因是因為盤尼⻄林注射到體內會和自體的蛋白形成聚合物，此聚合物會誘發TH2細胞的生成，再藉著相關性辨識去活化B細胞產生IgE引起過敏反應

正確答案：A. 如果一個B細胞的抗原接受器是辨識一種病毒的表面蛋白，而輔助型T細胞的抗原接受器是辨識此病毒內部的核心蛋白，這個輔助型T細胞是無法協助前述B細胞的活化